Placa motora es la unión entre la neurona motora y el:
1. Músculo liso.
2. Músculo esquelético.
3. Músculo cardiaco.
4. Huso muscular.
5. Tendón.

Respuesta correcta: 2. Músculo esquelético.